Clinical trial exclusion criterion:
HFpEF: prior history of LVEF below 50%, acute decompensated HF, moderate or greater valvular disease, significant cardiac arrhythmias, pericardial disease, congenital heart disease, primary pulmonary hypertension

Annotated entities:
- Condition: "HFpEF"
- Temporal: "prior history of"
- Measurement: "LVEF"
- Value: "below 50%"
- Qualifier: "acute"
- Condition: "decompensated HF"
- Qualifier: "moderate"
- Qualifier: "greater"
- Condition: "valvular disease"
- Qualifier: "significant"
- Condition: "cardiac arrhythmias"
- Condition: "pericardial disease"
- Condition: "congenital heart disease"
- Condition: "primary pulmonary hypertension"